單純性主動脈窄縮症（isolated coarctation of aorta）之手術治療，可以包括下列那些術式？ ①開放性動脈導管置放支架（stent）  ②鎖骨下動脈皮瓣主動脈成形術（subclavian flap aortoplasty）  ③布塊擴大術（patch augmentation） ④廣泛切除窄縮部分再兩端吻合 （extended resection with primary anastomosis）
A. ①②
B. ①③
C. ①④
D. ②③④

正確答案：D. ②③④